Patients whose tracheas were not extubated in OR or PACU.

The above is a clinical trial exclusion criterion. Annotated with entity spans:
Patients whose [Qualifier: tracheas] were [Negation: not] [Procedure: extubated] in [Visit: OR] or [Visit: PACU].